What type of sequences do enhancers evolve from?

Studies have identified enhancers that were pivotal for morphological divergence and highlighted how novel genetic networks shaping form emerged from pre-existing ones.Most of the recently evolved enhancers arise from ancestral dna exaptation , rather than lineage-specific expansions of repeat elements.